下列那個是屬於補體活化替代途徑（alternative pathway）的 C3 補體轉化（C3 convertase）？
A. C3a
B. C3b
C. C3bBb
D. C4b2a

正確答案：C. C3bBb